7. Subjects who have received an investigational drug within 30 days prior to the initial dose of study medication.

The above is a clinical trial exclusion criterion. Annotated with entity spans:
[Parsing_Error: 7.] [Non-query-able: Subjects who have received an investigational drug within 30 days prior to the initial dose of study medication.]